Clinical trial exclusion criterion:
Evidence of iron overload or disturbances in the utilisation of iron

Entity relations:
- multi("iron overload", "iron")
- multi("disturbances in the utilisation of iron", "iron")
- OR("iron overload", "disturbances in the utilisation of iron")